Patients who have given written informed consent

The above is a clinical trial inclusion criterion. Annotated with entity spans:
[Informed_consent: Patients who have given written informed consent]